Morbidly obese with BMI ≥ 40

The above is a clinical trial exclusion criterion. Annotated with entity spans:
[Condition: Morbidly obese] with [Measurement: BMI] [Value: ≥ 40]